Clinical trial inclusion criterion:
Planning neuraxial anesthesia

Entity relations:
- Has_mood("neuraxial anesthesia", "Planning")